Hypertension - untreated (Systolic Blood Pressure (SBP) ≥ 140 mm Hg or Diastolic Blood Pressure (DBP) ≥ 90 mm Hg) or treated

The above is a clinical trial inclusion criterion. Annotated with entity spans:
[Condition: Hypertension] - [Qualifier: untreated] ([Measurement: Systolic Blood Pressure (SBP)] [Value: ≥ 140 mm Hg] or [Measurement: Diastolic Blood Pressure (DBP)] [Value: ≥ 90 mm Hg]) or [Qualifier: treated]